50歲男性，患有糖尿病多年，未規則服用降血糖藥物，因為右眼紅腫疼痛及發燒2天，至急診就醫，診斷有 眼內炎（endophthalmitis），腹部超音波檢查發現有肝臟膿瘍。在國內，這位病人最恰當的抗生素治療為
 何？
A. ceftriaxone
B. vancomycin
C. cefazolin
D. cefmetazole

正確答案：A. ceftriaxone